Clinical trial inclusion criterion:
Severe hypernatraemia

Entity relations:
- Has_qualifier("hypernatraemia", "Severe")